Clinical trial inclusion criterion:
8. No history of drug allergy

Annotated entities:
- Condition: "allergy"
- Drug: "drug"
- Negation: "No"